關於肌力訓練的描述，下列何者錯誤？
A. 阻力訓練是借重高阻力之訓練，通常是一種等長性之肌肉收縮（isometric contraction）
B. 等長阻力訓練肌肉維持在等長狀態對抗阻力作收縮訓練，其關節並不產生動作
C. 等張性運動（isotonic exercise）就是等角速度運動（isokinetic exercise）
D. 阻力訓練對心臟的負荷較大，一般對心臟病患或老年人較不建議

正確答案：C. 等張性運動（isotonic exercise）就是等角速度運動（isokinetic exercise）